以下有關性腺（gonad）分化的敘述，何者正確？
A. 性腺索（gonadal cord）在女性發育成原始濾泡（primordial follicles）
B. 皮質索（cortical cord）在男性發育成副睪（epididymis）
C. 性腺索（gonadal cord）在男性發育成細精管（seminiferous tubules）
D. 皮質索（cortical cord）在女性發育成輸卵管（oviduct）

正確答案：C. 性腺索（gonadal cord）在男性發育成細精管（seminiferous tubules）